Clinical trial exclusion criterion:
Dysregulated thyroid diseases, use of antithyroid treatment.

Entity relations:
- Has_qualifier("thyroid diseases", "Dysregulated")
- OR("thyroid diseases", "antithyroid treatment")